Clinical trial exclusion criterion:
Patients on chronic (longer than the prior 6 months) anticoagulation other than with antiplatelet medications;

Annotated entities:
- Drug: "anticoagulation"
- Negation: "other than"
- Drug: "antiplatelet"
- Temporal: "longer than the prior 6 months"